膝反射（knee jerk reflex），主要是測試下列何者的反應？
A. 股神經（femoral nerve）
B. 閉孔神經（obturator nerve）
C. 坐骨神經（sciatic nerve）
D. 脛神經（tibial nerve）

正確答案：A. 股神經（femoral nerve）